Clinical trial exclusion criterion:
An initial plasma sodium concentration of lower than 130 mmol/L

Entity relations:
- Has_value("plasma sodium concentration", "lower than 130 mmol/L")
- Has_multiplier("plasma sodium concentration", "initial")